Female subjects with a positive urine pregnancy test

The above is a clinical trial exclusion criterion. Annotated with entity spans:
[Person: Female] subjects with a [Value: positive] [Measurement: urine pregnancy test]